下列何種類鴉片類（Opioids）藥物因具有較高脂溶性（high lipid solubility），且分子量較小，故可經皮吸收（transdermal absorption）？
A. Morphine
B. Meperidine
C. Remifentanil
D. Fentanyl

正確答案：D. Fentanyl